Clinical trial inclusion criterion:
Atrial fibrillation and not on oral anticoagulation (OAC) therapy but eligible

Annotated entities:
- Condition: "Atrial fibrillation"
- Measurement: "not"
- Procedure: "oral anticoagulation (OAC) therapy"
- Non-representable: "but eligible"